What is endoplasmic reticulum stress?

Endoplasmic reticulum stress is an imbalance between protein folding load and capacity leading to the accumulation of unfolded proteins in the endoplasmic reticulum lumen.